Clinical trial exclusion criterion:
Known hypersensitivity to zoledronic acid or other bisphosphonates

Annotated entities:
- Condition: "hypersensitivity"
- Drug: "zoledronic acid"
- Drug: "other bisphosphonates"